Clinical trial exclusion criterion:
Patients with cardiac failure or a history of cardiac failure (New York Heart Association [NYHA] Stages 3 to 4)

Annotated entities:
- Condition: "cardiac failure"
- Temporal: "history of cardiac failure"
- Measurement: "New York Heart Association Stages"
- Value: "3 to 4"
- Measurement: "NYHA"